Clinical trial exclusion criterion:
The patient has received prior surgery for primary tumor or lymph node ( except for biopsy )

Annotated entities:
- Temporal: "prior"
- Procedure: "surgery"
- Qualifier: "primary"
- Condition: "tumor"
- Condition: "lymph node"
- Procedure: "biopsy"
- Negation: "except for"